Clinical trial exclusion criterion:
Patients with caudal equine syndrome.

Annotated entities:
- Condition: "caudal equine syndrome"